Clinical trial exclusion criterion:
Individuals who have performed other restorations in the last 12 months;

Annotated entities:
- Procedure: "other restorations"
- Temporal: "in the last 12 months"